Clinical trial exclusion criterion:
High blood cholesterol diagnosed by a doctor

Annotated entities:
- Condition: "High blood cholesterol"